Clinical trial exclusion criterion:
Chronic or acute pain requiring prescription pain medication(s) (narcotic or synthetic narcotic)

Entity relations:
- Has_qualifier("pain", "Chronic")
- AND("pain", "prescription pain medication")
- Subsumes("prescription pain medication", "narcotic")
- OR("Chronic", "acute")
- OR("narcotic", "synthetic narcotic")